下列何種維他命缺乏時會造成疾病，但不直接在葡萄糖分解代謝產生 ATP 中擔任 co-enzyme？
A. Thiamine
B. Riboflavin
C. Niacin
D. Vitamin D

正確答案：D. Vitamin D